Need for a double kidney transplantation.

The above is a clinical trial exclusion criterion. Annotated with entity spans:
[Mood: Need for] a [Procedure: double kidney transplantation].